Clinical trial inclusion criterion:
informed consent and (if applicable) assent

Annotated entities:
- Informed_consent: "informed consent and (if applicable) assent"